Be conscious and able to comply with study procedures.

The above is a clinical trial inclusion criterion. Annotated with entity spans:
[Non-query-able: Be conscious and able to comply with study procedures.]